Clinical trial exclusion criteria:
Preoperative Hemoglobin <U+2266>11 g/dl
History of infection or intraarticular fracture of the affective hip
Renal function deficiency (GFR <30 ml/min/1.73m2)
Elevated liver enzyme (aspartate transaminase (AST)/ alanine transaminase(ALT) level are more than twice normal range) , history of liver cirrhosis, impaired liver function(elevated total bilirubin level) and coagulopathy (including long-term use anticoagulant)
History of deep vein thrombosis, ischemic heart disease or stroke
Contraindications of tranexamic acid, floseal, or rivaroxaban
Allergy to tranexamic acid, floseal, rivaroxaban, or the excipients
History of heparin-induced thrombocytopenia (HIT)
Coagulopathy or bleeding tendency caused by organ dysfunction, such as cirrhosis, bone marrow suppression etc.
Patient who have active bleeding disorder, such as intracranial hemorrhage, upper gastrointestinal bleeding, hematuria.
Patients with known allergies to materials of bovine origin.

Annotated entities:
- Temporal: "Preoperative"
- Measurement: "Hemoglobin"
- Value: "<U+2266>11 g/dl"
- Condition: "infection"
- Condition: "intraarticular fracture"
- Qualifier: "affective hip"
- Temporal: "History"
- Condition: "Renal function deficiency"
- Measurement: "GFR"
- Value: "<30 ml/min/1.73m2"
- Measurement: "liver enzyme"
- Value: "Elevated"
- Measurement: "aspartate transaminase (AST)/ alanine transaminase(ALT) level"
- Value: "more than twice normal range"
- Temporal: "history"
- Condition: "liver cirrhosis"
- Condition: "impaired liver function"
- Value: "elevated"
- Measurement: "total bilirubin level"
- Condition: "coagulopathy"
- Multiplier: "long-term use"
- Drug: "anticoagulant"
- Condition: "deep vein thrombosis"
- Condition: "ischemic heart disease"
- Condition: "stroke"
- Condition: "Contraindications"
- Drug: "tranexamic acid"
- Drug: "floseal"
- Drug: "rivaroxaban"
- Condition: "Allergy"
- Drug: "tranexamic acid"
- Drug: "floseal"
- Drug: "rivaroxaban"
- Drug: "excipients"
- Condition: "heparin-induced thrombocytopenia (HIT)"
- Temporal: "History"
- Condition: "Coagulopathy"
- Condition: "bleeding tendency"
- Condition: "organ dysfunction"
- Condition: "cirrhosis"
- Condition: "bone marrow suppression"
- Qualifier: "active"
- Condition: "bleeding disorder"
- Condition: "intracranial hemorrhage"
- Condition: "upper gastrointestinal bleeding"
- Condition: "hematuria"
- Condition: "allergies"
- Drug: "materials of bovine origin"